Clinical trial inclusion criterion:
ALT and AST <2.5 × ULN; liver metastases, if any, the ALT and AST<5 × ULN

Annotated entities:
- Measurement: "ALT"
- Measurement: "AST"
- Value: "<2.5 × ULN"
- Condition: "liver metastases"
- Measurement: "ALT"
- Measurement: "AST"
- Value: "<5 × ULN"